Clinical trial exclusion criterion:
Women requiring hysterectomy for treatment of H Mole

Annotated entities:
- Person: "Women"
- Procedure: "hysterectomy"
- Condition: "H Mole"